Clinical trial exclusion criterion:
Patient who sign for single port gynecologic laparoscopic surgery or NOTE surgery

Entity relations:
- Has_qualifier("gynecologic laparoscopic surgery", "single port")
- OR("gynecologic laparoscopic surgery", "NOTE surgery")